How are topologically associating domains (TAD) associated with replication timing?

Topologically associating domains and their long-range contacts are established during early G1 coincident with the establishment of the replication-timing program.